甲狀腺素是由那一種胺基酸轉變而成？
A. 白胺酸（leucine）
B. 酪胺酸（tyrosine）
C. 甘胺酸（glycine）
D. 絲胺酸（serine）

正確答案：B. 酪胺酸（tyrosine）